Clinical trial exclusion criterion:
Known allergy/ hypersensitivity reaction to Brimonidine

Annotated entities:
- Condition: "allergy"
- Condition: "hypersensitivity"
- Drug: "Brimonidine"